下列有關 scimitar 症候群之敘述，何者為錯？
A. 常合併心房中隔缺損（atrial septal defect）
B. 可見右肺發育不全且合併右心症（dextroposition of heart）
C. 右肺靜脈不正常注入下腔靜脈（inferior vena cava）
D. 常合併游離肺（pulmonary sequestration）

正確答案：A. 常合併心房中隔缺損（atrial septal defect）